Adult Patients with Overt Hepatic Encephalopathy.

The above is a clinical trial inclusion criterion. Annotated with entity spans:
[Person: Adult] Patients with [Condition: Overt Hepatic Encephalopathy].